The participant is an outpatient of either sex aged >= 30 and < 80 years.

The above is a clinical trial inclusion criterion. Annotated with entity spans:
The participant is an outpatient of either sex [Person: aged] [Value: >= 30 and < 80 years].